Clinical trial inclusion criterion:
An average defecation frequency (DF) of <3 per week based on a 3-week defecation diary (patient-reported)

Entity relations:
- Subsumes("average defecation frequency", "DF")
- Has_value("average defecation frequency", "<3 per week")
- AND("average defecation frequency", "3-week defecation diary")
- Has_qualifier("3-week defecation diary", "patient-reported")